¿Cuál de los siguientes medicamentos se emplea en el tratamiento de la enfermedad de Chagas?
1. Anfotericina B.
2. Cotrimoxazol.
3. Ivermectina.
4. Albendazol.
5. Benznidazol.

Respuesta correcta: 5. Benznidazol.